Has a history of or concurrent congestive heart failure of any grade

The above is a clinical trial exclusion criterion. Annotated with entity spans:
Has a [Temporal: history] of or [Temporal: concurrent] [Condition: congestive heart failure] of any grade